Recent administration of any i.v. or s.c. anticoagulation within 12 hours, including unfractionated heparin, enoxaparin, and/or bivalirudin or current use of oral anticoagulation (i.e. warfarin or a NOACs)

The above is a clinical trial exclusion criterion. Annotated with entity spans:
Recent administration of any i.v. or s.c. [Drug: anticoagulation] [Temporal: within 12 hours], including [Drug: unfractionated heparin], [Drug: enoxaparin], and/or [Drug: bivalirudin] or current use of [Drug: oral anticoagulation] (i.e. [Drug: warfarin] or a [Drug: NOACs])